Any major organ system disease (by judgment of the study medical team)

The above is a clinical trial exclusion criterion. Annotated with entity spans:
Any [Condition: major organ system disease] (by judgment of the study medical team)